Clinical trial exclusion criterion:
Completely edentulous

Entity relations:
- Has_qualifier("edentulous", "Completely")